Clinical trial exclusion criterion:
Hypersensitivity on Colchicine

Annotated entities:
- Condition: "Hypersensitivity"
- Drug: "Colchicine"